Body mass index (BMI) =18 to =30 kg/m2

The above is a clinical trial inclusion criterion. Annotated with entity spans:
[Measurement: Body mass index] ([Measurement: BMI]) [Value: =18 to =30 kg/m2]